History of receiving any investigational treatment within approximately 28 days prior to randomization.

The above is a clinical trial exclusion criterion. Annotated with entity spans:
[Temporal: History of] receiving any [Procedure: investigational treatment] [Temporal: within approximately 28 days prior to randomization].